Clinical trial exclusion criterion:
History of atrial fibrillation or muscle disease (myopathy)

Annotated entities:
- Condition: "atrial fibrillation"
- Condition: "muscle disease"
- Condition: "myopathy"